Clinical trial exclusion criterion:
NSAID and other analgesics used the 48 hours previous to the surgery

Annotated entities:
- Drug: "NSAID"
- Qualifier: "other"
- Drug: "analgesics"
- Temporal: "48 hours previous to the surgery"
- Reference_point: "the surgery"